Clinical trial exclusion criterion:
Subjects with high gastrointestinal bleeding risk, including the following conditions: local active ulcer lesions with positive fecal occult blood test (++); history of black stool, or vomiting blood in the past 3 months;unresected primary lesion in stomach with positive fecal occult blood test (+), ulcerated gastric carcinoma with massive alimentary tract bleeding risk judged by PIs based on gastric endoscopy result;

Annotated entities:
- Observation: "gastrointestinal bleeding risk"
- Qualifier: "high"
- Condition: "ulcer lesions"
- Qualifier: "active"
- Measurement: "fecal occult blood test"
- Value: "positive"
- Value: "++"
- Condition: "black stool"
- Condition: "vomiting blood"
- Temporal: "past 3 months"
- Condition: "primary lesion"
- Qualifier: "stomach"
- Measurement: "fecal occult blood test"
- Value: "positive"
- Value: "+"
- Condition: "ulcerated gastric carcinoma"
- Qualifier: "alimentary tract"
- Qualifier: "massive"
- Observation: "bleeding risk"